Clinical trial inclusion criterion:
To be eligible patients must fulfill the following criteria: Patients on ongoing hypertensive therapy must have a blood pressure ≥ 135/85 mm Hg but lower than 170/105 mm Hg at baseline (Day -1) AND patients must be on stable antihypertensive medications for at least 8 weeks prior to baseline (Day -1).; Newly diagnosed hypertensive patients must have a blood pressure ≥ 135/85 mm Hg but lower than 170/105 mm Hg at baseline (Day -1).

Annotated entities:
- Procedure: "hypertensive therapy"
- Measurement: "blood pressure"
- Value: "≥ 135/85 mm Hg"
- Value: "lower than 170/105 mm Hg"
- Drug: "antihypertensive medications"
- Qualifier: "stable"
- Temporal: "at least 8 weeks prior to baseline"
- Qualifier: "Newly diagnosed"
- Condition: "hypertensive patients"
- Measurement: "blood pressure"
- Value: "≥ 135/85 mm Hg"
- Value: "lower than 170/105 mm Hg"
- Temporal: "at baseline (Day -1)"
- Reference_point: "baseline (Day -1)"
- Reference_point: "baseline"